Clinical trial inclusion criterion:
age=65 years

Entity relations:
- Has_value("age", "=65 years")